Clinical trial exclusion criterion:
Having life expectancy less than 1 year

Annotated entities:
- Observation: "life expectancy"
- Value: "less than 1 year"